Clinical trial exclusion criterion:
Any patients contraindicated for vaginal delivery

Annotated entities:
- Condition: "contraindicated"
- Procedure: "vaginal delivery"